Hypotension

The above is a clinical trial exclusion criterion. Annotated with entity spans:
[Condition: Hypotension]